普拉德-威利症候群（Prader-Willi Syndrome）是下列何種異常造成的遺傳性疾病？
A. 組織結構蛋白（structural proteins）異常
B. 細胞受器（receptor）異常
C. 基因印記（genomic imprinting）異常
D. 染色體轉位（translocation）

正確答案：C. 基因印記（genomic imprinting）異常